Clinical trial exclusion criterion:
Women who are pregnant or breastfeeding (pregnancy defined as the state of a female after conception until the termination of gestation, confirmed by a positive human chorionic gonadotropin laboratory test (> 5mIU/mL)

Entity relations:
- Subsumes("positive", "> 5mIU/mL")
- Has_value("human chorionic gonadotropin", "positive")
- multi("human chorionic gonadotropin laboratory test", "human chorionic gonadotropin")
- AND("pregnant", "human chorionic gonadotropin laboratory test")
- OR("pregnant", "breastfeeding")